Clinical trial exclusion criterion:
Irregular pulse, or pulse 100 or higher.

Entity relations:
- Has_value("pulse", "Irregular")
- Has_value("pulse", "100 or higher")
- OR("pulse", "pulse")